HFpEF: physician-confirmed diagnosis of HF, symptomatic HF, LVEF at least 50%, elevated LV filling pressure by catheterization, echocardiographic criteria or B-type-natriuretic peptide > 100, current BP < 160/90

The above is a clinical trial inclusion criterion. Annotated with entity spans:
[Condition: HFpEF]: [Qualifier: physician-confirmed] diagnosis of [Condition: HF], [Qualifier: symptomatic] [Condition: HF], [Measurement: LVEF] [Value: at least 50%], [Value: elevated] [Measurement: LV filling pressure] by [Procedure: catheterization], [Non-representable: echocardiographic criteria] or [Measurement: B-type-natriuretic peptide] [Value: > 100], [Measurement: current BP] [Value: < 160/90]